For women of childbearing age is a negative result of a pregnancy test before vaccination.

The above is a clinical trial inclusion criterion. Annotated with entity spans:
[Pregnancy_considerations: For women of childbearing age is a negative result of a pregnancy test before vaccination.]